1. Male and female recipients of all races, ≥18 years of age.

The above is a clinical trial inclusion criterion. Annotated with entity spans:
1. [Person: Male] and [Person: female] recipients of all races, [Value: ≥18 years] of [Person: age].